Inteligencia interpersonal, inteligencia espacial e inteligencia lógico-matemática, son tipos de inteligencia pertenecientes :
1. Al modelo de Cattell sobre la inteligencia.
2. A la Teoría Triárquica de Sternberg.
3. A la propuesta ofrecida por Eysenck.
4. Al modelo de las Inteligencias Múltiples de Gardner.
5. A la propuesta de Guilford sobra la estructura del intelecto.

Respuesta correcta: 4. Al modelo de las Inteligencias Múltiples de Gardner.